Clinical trial inclusion criterion:
Recently commenced psychotherapy (within four weeks of study entry)

Annotated entities:
- Procedure: "psychotherapy"
- Temporal: "within four weeks of study entry"
- Temporal: "Recently"